Renal impairment

The above is a clinical trial exclusion criterion. Annotated with entity spans:
[Condition: Renal impairment]